Clinical trial inclusion criterion:
>/= 18 years old

Entity relations:
- Has_value("old", ">/= 18 years old")